有關膽囊結石之敘述，何者錯誤？
A. 長期禁食或使用全靜脈營養治療之病患與膽囊結石之形成有相關性
B. 膽囊結石可分為色素結石與膽固醇結石兩大類
C. 膽囊結石的併發症包括急性膽囊炎、膽石性胰臟炎、腸阻塞
D. 膽石性急性膽囊炎採取以腹腔鏡膽囊切除手術治療為絕對禁忌症

正確答案：D. 膽石性急性膽囊炎採取以腹腔鏡膽囊切除手術治療為絕對禁忌症